administration of a vaccine during the period starting one month before the dose of vaccine and ending one month after

The above is a clinical trial exclusion criterion. Annotated with entity spans:
administration of a [Procedure: vaccine] [Temporal: during the period starting one month before the dose of vaccine and ending one month after]